下列藥物何者為PGI2致效劑，可用於治療肺高壓（pulmonary hypertension）？
A. treprostinil
B. alprostadil
C. misoprostol
D. latanoprost

正確答案：A. treprostinil